Subject must have symptoms that are consistent with vasospastic angina with planned Coronary angiography and Provocation test.

The above is a clinical trial inclusion criterion. Annotated with entity spans:
Subject must have [Condition: symptoms] that are consistent with [Condition: vasospastic angina] with [Mood: planned] [Procedure: Coronary angiography] and [Procedure: Provocation test].